Clinical trial exclusion criterion:
drug-alcoholics addiction ;

Entity relations:
- OR("alcoholics addiction", "addiction drug")